有關小兒麻醉之敘述，何者最正確？
A. 喝牛奶後只要空腹 3 小時即可接受非緊急手術麻醉
B. 過敏性鼻炎合併流鼻水必須先控制 4-6 週，才可接受非緊急手術麻醉
C. 四歲兒童吃完漢堡後須空腹 8 小時才可接受非緊急手術麻醉
D. 有輕微發燒合併咳痰，仍可接受非緊急手術麻醉

正確答案：C. 四歲兒童吃完漢堡後須空腹 8 小時才可接受非緊急手術麻醉